32 歲男性病人，最近數年內都沒有吃藥，平常體重 60 kg，血壓 120/80 mmHg，血液肌酸酐 1.0 mg/dL。 3 週前開始出現水腫、少尿與咳血。目前體重 65 kg，血壓 140/100 mmHg，血色素 8.0 g/dL，血液肌酸酐 2.0 mg/dL，尿液紅血球 20～30/HPF，紅血球圓柱體（RBC cast）+，蛋白質 trace，胸部 X 光有兩側肺泡浸潤（alveolar infiltrates）。最不可能的診斷是：
A. 快速進行性腎絲球腎炎
B. Goodpasture 氏症候群
C. 急性腎小管壞死
D. 紅斑性狼瘡腎炎

正確答案：C. 急性腎小管壞死